一位8歲兒童，原本個性害羞，在搬家換學校後，一直抱怨上學後自己身體不適、擔心父母親不來接自己回家，某天上學前會哭鬧抗拒上學，晚上睡覺一直做有關爸媽不見了的惡夢，持續超過一個月。下列何者正確？
A. 以上的描述完全符合兒童的廣泛性焦慮症（generalized anxiety disorder）的特徵
B. 第一線的治療方式是精神分析性的心理治療
C. 若要藥物治療，應選擇具血清素（serotonin）回收抑制效果的抗憂鬱劑
D. 症狀明顯改善之後，才對其家人進行衛教和家族性的心理介入

正確答案：C. 若要藥物治療，應選擇具血清素（serotonin）回收抑制效果的抗憂鬱劑